關於原核細胞蛋白質合成的啟始階段（initiation stage），下列敘述何者正確？
A. fMet-tRNAifMet可同時使用在蛋白質合成的啟始（initiation）與延伸（elongation）階段
B. fMet-tRNAifMet結合在80S起始複合體的P位置（P site）
C. mRNA 5'端的Shine-Dalgarno sequence會與30S核糖體（30S ribosome）中的16S rRNA 3'端配對
D. 起始因子（initiation factor）IF1會促進fMet-tRNAifMet結合在A位置

正確答案：C. mRNA 5'端的Shine-Dalgarno sequence會與30S核糖體（30S ribosome）中的16S rRNA 3'端配對